Clinical trial exclusion criterion:
Patients with hip fractures not requiring surgery (e.g. greater trochanter avulsion) will also be excluded.

Annotated entities:
- Condition: "hip fractures"
- Procedure: "surgery"
- Qualifier: "requiring surgery"
- Negation: "not"
- Condition: "greater trochanter avulsion"
- Undefined_semantics: "hip fractures not requiring surgery"